Clinical trial exclusion criterion:
use of NSAIDs in the 5 days before blood donation;

Entity relations:
- Has_temporal("NSAIDs", "in the 5 days before blood donation")